Which is the cellular localization of the protein Opa1?

Opa1 is found normally in the mitochondrial intermembrane space.